Are psychologically stable and suitable for interventions determined by the investigator

The above is a clinical trial inclusion criterion. Annotated with entity spans:
Are [Condition: psychologically stable] and [Condition: suitable for interventions] [Qualifier: determined by the investigator]